Amphotericin B 屬於一種 Polyenes 抗真菌藥物，直接與麥角固醇（Ergosterol）結合破壞真菌細胞膜，但在治療新型隱球菌已出現抗藥性，抗藥菌株最可能改變產生何種固醇，取代敏感性的麥角固醇？
A. Cholesterol
B. Sitosterol
C. Lanosterol
D. Fecosterol

正確答案：D. Fecosterol